major elective gastrointestinal, gynecological, prostate or bladder surgery patients who are = 60 years old.

The above is a clinical trial inclusion criterion. Annotated with entity spans:
major [Qualifier: elective] [Procedure: gastrointestinal], [Procedure: gynecological], [Procedure: prostate] or [Procedure: bladder surgery] patients who are [Value: = 60 years old].